Clinical trial exclusion criterion:
comorbidities other than AF, which present an indication for anticoagulation;

Annotated entities:
- Condition: "AF"
- Negation: "other than"
- Condition: "comorbidities"
- Condition: "indication"
- Procedure: "anticoagulation"